Clinical trial inclusion criterion:
Diagnosis of sickle cell disease

Annotated entities:
- Condition: "sickle cell disease"
- Mood: "Diagnosis"